What is the phenomenon of gene kissing?

This positioning can also result in the clustering of genes with similar expression patterns, a phenomenon sometimes called "gene kissing."